Any suicidal ideation with intent with or without a plan, at the time of or within 6 months of Screening, as indicated by answering "Yes" to questions 4 or 5 on the Suicidal Ideation section of the Columbia-Suicide Severity Rating Scale (C-SSRS)

The above is a clinical trial exclusion criterion. Annotated with entity spans:
Any [Condition: suicidal ideation] [Qualifier: with intent] [Qualifier: with] or [Qualifier: without a plan], [Temporal: at the time of] or [Temporal: within 6 months of Screening], as indicated by answering "[Value: Yes]" to [Measurement: questions 4] or 5 on the [Procedure: Suicidal Ideation section of the Columbia-Suicide Severity Rating Scale (C-SSRS)]